Clinical trial inclusion criterion:
Primary B-NHL, PTCL (ALK+ anaplastic large cell lymphoma and NK(natural killer cell )/T cell lymphoma were excluded) or HL patients confirmed by histopathology;

Entity relations:
- Has_negation("ALK+ anaplastic large cell lymphoma and NK(natural killer cell )/T cell lymphoma", "excluded")
- OR("Primary B-NHL", "PTCL", "HL")